Clinical trial exclusion criterion:
Meets Diagnostic and Statistical Manual of Mental Disorders, 5th Edition (DSM-5) criteria for any Substance Use Disorder except caffeine-related disorders, or tobacco-related disorders.

Annotated entities:
- Condition: "Substance Use Disorder"
- Condition: "caffeine-related disorders"
- Negation: "except"
- Condition: "tobacco-related disorders"
- Measurement: "Diagnostic and Statistical Manual of Mental Disorders, 5th Edition (DSM-5) criteria"
- Value: "Meets"